age >18 years

The above is a clinical trial inclusion criterion. Annotated with entity spans:
[Person: age] [Value: >18 years]